Central Nervous System (CNS) abnormalities (e.g., cerebral aneurysm) and/or other vascular abnormalities such as vasculitis or pre-existing stroke, motor tics or a family history or diagnosis of Tourette's syndrome, seizures (convulsions, epilepsy), or abnormal EEGs

The above is a clinical trial exclusion criterion. Annotated with entity spans:
[Condition: Central Nervous System (CNS) abnormalities] (e.g., [Condition: cerebral aneurysm]) and/or other [Condition: vascular abnormalities] such as [Condition: vasculitis] or [Temporal: pre-existing] [Condition: stroke], [Condition: motor tics] or a [Observation: family history] or [Observation: diagnosis] of [Condition: Tourette's syndrome], [Condition: seizures] ([Condition: convulsions], [Condition: epilepsy]), or [Qualifier: abnormal] [Condition: EEGs]